Clinical trial inclusion criteria:
Inclusion Criteria Patients: Fulfilling the diagnostic criteria of schizophrenia or schizoaffective disorder according to ICD-10 (International Classification of Diseases version 10) or DSM-IV/V (Diagnostic and Statistical Manual version 4 /5), Age 18-45 years, Never treated with antipsychotic compounds or central nervous system (CNS) stimulants, Legally competent
Inclusion criteria controls: Matching patients on age (+/- 2 years), sex and parental socioeconomic status, Age 18-45 years, No psychiatric or physical disease.

Annotated entities:
- Observation: "Patients"
- Condition: "schizophrenia"
- Condition: "schizoaffective disorder"
- Qualifier: "ICD-10 (International Classification of Diseases version 10)"
- Qualifier: "DSM-IV/V (Diagnostic and Statistical Manual version 4 /5)"
- Person: "Age"
- Value: "18-45 years"
- Negation: "Never"
- Drug: "antipsychotic compounds"
- Drug: "central nervous system (CNS) stimulants"
- Observation: "Legally competent"
- Observation: "controls"
- Non-representable: "Matching patients on age (+/- 2 years), sex and parental socioeconomic status"
- Person: "Age"
- Value: "18-45 years"
- Negation: "No"
- Condition: "psychiatric disease"
- Condition: "physical disease"